下列關於 trihexyphenidyl 之敘述，何者正確？
A. 能活化 cholinergic 受體
B. 用於治療帕金森氏症
C. 是 dopamine 受體之致效劑
D. 可抑制 monoamine oxidase

正確答案：B. 用於治療帕金森氏症